Clinical trial exclusion criterion:
BMI > 30 kg.m-2,

Entity relations:
- Has_value("BMI", "> 30 kg.m-2")